Clinical trial exclusion criterion:
Insulin sensitizing treatment within 3 months prior to or during the eight week study period.

Entity relations:
- Has_temporal("Insulin sensitizing treatment", "within 3 months prior to eight week study period")
- OR("within 3 months prior to eight week study period", "during the eight week study period")